History of latex allergy

The above is a clinical trial exclusion criterion. Annotated with entity spans:
[Temporal: History] of [Drug: latex] [Condition: allergy]